下列有關甲狀腺（thyroid gland）及副甲狀腺（parathyroid gland）之發育，何項敘述正確？
A. 甲狀腺主要源於第三咽弓（pharyngeal arch）
B. 上與下副甲狀腺均來自第三咽囊（pharyngeal pouch）
C. 上與下副甲狀腺分別來自第二及第三咽囊（pharyngeal pouch）
D. 甲狀腺亦有源自第四咽囊（pharyngeal pouch）

正確答案：D. 甲狀腺亦有源自第四咽囊（pharyngeal pouch）